一位剛出生之足月新生兒被發現全身有許多出血小點（petechiae）及紫斑（purpura）。實驗室檢查發現其白血球 11,000/uL，血紅素 14 gm/dL，血小板 8,000/uL，病兒接受 6 單位的血小板濃縮液輸注後 1 小時再檢驗血小板數值仍然偏低，為 9,000/uL，但於輸注來自母親的 washed 血小板濃縮液後，血小板數值增為 90,000/uL，出血狀況獲得改善，則下列何者是正確的解釋？
A. 病兒血中常可能發現來自母親，對抗血小板 PLA-1 抗原之血小板抗體
B. 母親可能是不明原因血小板低下紫斑症（idiopathic thrombocytopenic purpura）的病人
C. 母親最可能有血小板 PLA-1 抗原
D. 母親應為全身紅斑性狼瘡合併低血小板之病人

正確答案：A. 病兒血中常可能發現來自母親，對抗血小板 PLA-1 抗原之血小板抗體